History of malignancy except for treated cervical carcinoma in situ in the past 5 years.

The above is a clinical trial exclusion criterion. Annotated with entity spans:
[Temporal: History] of [Condition: malignancy] [Negation: except for] [Qualifier: treated] [Condition: cervical carcinoma in situ] [Temporal: in the past 5 years].